Patients who are hemodynamically unstable even if they have hemoglobin levels> 6g / dL.

The above is a clinical trial exclusion criterion. Annotated with entity spans:
Patients who are [Condition: hemodynamically unstable] even if they have [Measurement: hemoglobin levels][Value: > 6g / dL].